就病理生理機轉，所謂非 Q 波心肌梗塞的發生與下列何者無關？
A. 冠狀動脈血管血栓完全阻塞
B. 冠狀動脈間有豐富的側枝循環
C. 冠狀動脈血管血栓短暫阻塞
D. 心肌梗塞的範圍狹小

正確答案：A. 冠狀動脈血管血栓完全阻塞